1. Speak, read, and understand English or Spanish and is willing and able to provide written informed consent on an IRB-approved form prior to the initiation of any study procedures;

The above is a clinical trial inclusion criterion. Annotated with entity spans:
[Parsing_Error: 1.] [Non-query-able: Speak, read, and understand English or Spanish and is willing and able to provide written informed consent on an IRB-approved form prior to the initiation of any study procedures;]